下列那一項不是腸病毒七十一型重症病患的特點？
A. 容易侵犯腦幹部位
B. 死亡病例九成以上有病毒性心肌炎
C. 大多表現為手足口病
D. 致命病例常出現肺水腫

正確答案：B. 死亡病例九成以上有病毒性心肌炎